Clinical trial exclusion criterion:
9. Any of the following within the 12 months prior to study drug administration: myocardial infarction, severe/unstable angina, coronary/peripheral artery bypass graft, symptomatic congestive heart failure, cerebrovascular accident or transient ischemic attack, pulmonary embolism, deep vein thrombosis, or other thromboembolic event.

Entity relations:
- Has_temporal("myocardial infarction", "within the 12 months prior to study drug administration")
- Has_index("within the 12 months prior to study drug administration", "study drug administration")
- OR("within the 12 months prior to study drug administration", "study drug administration")
- OR("myocardial infarction", "deep vein thrombosis", "pulmonary embolism", "transient ischemic attack", "cerebrovascular accident", "symptomatic congestive heart failure", "coronary artery bypass graft", "peripheral artery bypass graft", "severe angina", "unstable angina", "other thromboembolic event")